Clinical trial inclusion criterion:
Patients must have measurable disease. If prior radiation therapy was administered, measurable disease must be outside the radiation field.

Annotated entities:
- Qualifier: "measurable disease"
- Procedure: "radiation therapy"
- Qualifier: "measurable disease"
- Qualifier: "outside the radiation field"